Clinical trial exclusion criterion:
Locally unresectable tumor

Annotated entities:
- Qualifier: "Locally unresectable"
- Condition: "tumor"